diagnosis of chronic pain

The above is a clinical trial exclusion criterion. Annotated with entity spans:
diagnosis of [Condition: chronic pain]